What is marked by DNaseI hypersensitive sites?

DNA hypomethylation and the presence of DNaseI hypersensitive sites correlate with transcriptional activity of P1.1. Mapping sites within the genome that are hypersensitive to digestion withDNaseI is an important method for identifying DNA elements that regulate transcription.